Clinical trial exclusion criterion:
asthma requiring regular therapy

Annotated entities:
- Condition: "asthma"
- Procedure: "regular therapy"